Paciente de 35 años que, debido a hematemesis por ulcus, recibe una transfusión de 2 concentrados de hematíes. A los 5-10 minutos de iniciarse la transfusión comienza con fiebre, escalofríos, hipotensión y dolor en región lumbar. ¿Cuál sería el diagnóstico más probable?
1. Contaminación bacteriana de la sangre.
2. Reacción febril secundaria a la transfusión.
3. Reacción febril por el plasma que contamina los hematíes.
4. Reacción transfusional hemolítica.

Respuesta correcta: 4. Reacción transfusional hemolítica.